Clinical trial inclusion criterion:
Cervical length <=25mm between 18(0) and 23(6) weeks

Annotated entities:
- Measurement: "Cervical length"
- Value: "<=25mm"
- Qualifier: "between 18(0) and 23(6) weeks"